Clinical trial inclusion criteria:
women and men between 18 - 80 years of age
type 2 diabetes mellitus
early to moderate stage diabetic retinopathy (ETDRS: 20 (microaneurysms only) to 35 (microaneurysms/ hemorrhages and/or hard exsudates)) in one or both eyes
stable HbA1c (± 0.5%) for at least 12 weeks
antidiabetic treatment with either diet, metformin, DPP4, GLP1, pioglitazone, acarbose, or respective combinations
HbA1c = 6.5 and = 10.0 %
body mass index < 46 kg/m2
office blood pressure = 150/95 mmHg (confirmed on a second day; 24h ambulatory blood pressure measurement (ABPM) is allowed to check accuracy of office values; inclusion with 24h mean blood pressure = 145/90 mm Hg is possible); patients with hypertension should be treated according to current treatment guidelines
at least 6 weeks after surgical sterilization by bilateral tubal ligation or bilateral oophorectomy
hysterectomy
= 50 years and in postmenopausal state > 1 year
< 50 years and in postmenopausal state > 1 year with serum follicle stimulating hormone (FSH) > 40 IU/l and serum estrogen < 30 ng/l or a negative estrogen test, both at screening or women of childbearing potential with a negative serum beta human chorionic gonadotropin (ß-hCG) pregnancy test at screening who agree to meet one of the following criteria from the time of screening, during the study and for a period of 4 days following the last administration of study medication:
correct use of one of the following accepted contraception methods: hormonal contraceptives (combined oral contraceptives, implants, transdermal patches, hormonal vaginal devices or injections with prolonged release), intrauterine device (IUD/IUS) or a double barrier method, e.g. condom and occlusive cap (diaphragm or cervical/vault caps) with spermicide (foam, gel, film, cream or suppository)
true abstinence (periodic abstinence and withdrawal are not acceptable methods of contraception)
sexual relationship only with female partners
sterile male partners
signed written informed consent and willingness to comply with treatment and follow-up procedures
capability of understanding the investigational nature, potential risks and benefits of the clinical trial

Annotated entities:
- Person: "women"
- Person: "men"
- Person: "age"
- Value: "between 18 - 80 years"
- Condition: "type 2 diabetes mellitus"
- Condition: "diabetic retinopathy"
- Qualifier: "early"
- Qualifier: "moderate stage"
- Measurement: "ETDRS"
- Value: "20"
- Value: "35"
- Qualifier: "eyes"
- Measurement: "HbA1c"
- Value: "± 0.5%"
- Temporal: "at least 12 weeks"
- Procedure: "antidiabetic treatment"
- Observation: "diet"
- Drug: "metformin"
- Drug: "DPP4"
- Drug: "GLP1"
- Drug: "pioglitazone"
- Drug: "acarbose"
- Measurement: "HbA1c"
- Value: "= 6.5 and = 10.0 %"
- Person: "body mass index"
- Value: "< 46 kg/m2"
- Measurement: "blood pressure"
- Value: "= 150/95 mmHg"
- Non-query-able: "(confirmed on a second day; 24h ambulatory blood pressure measurement (ABPM) is allowed to check accuracy of office values; inclusion with 24h mean blood pressure = 145/90 mm Hg is possible); patients with hypertension should be treated according to current treatment guidelines"
- Procedure: "surgical sterilization"
- Procedure: "bilateral tubal ligation"
- Procedure: "bilateral oophorectomy"
- Temporal: "at least 6 weeks"
- Procedure: "hysterectomy"
- Person: "years"
- Value: "= 50"
- Observation: "postmenopausal state"
- Temporal: "> 1 year"
- Pregnancy_considerations: "< 50 years and in postmenopausal state > 1 year with serum follicle stimulating hormone (FSH) > 40 IU/l and serum estrogen < 30 ng/l or a negative estrogen test, both at screening or women of childbearing potential with a negative serum beta human chorionic gonadotropin (ß-hCG) pregnancy test at screening who agree to meet one of the following criteria from the time of screening, during the study and for a period of 4 days following the last administration of study medication"
- Pregnancy_considerations: "correct use of one of the following accepted contraception methods: hormonal contraceptives (combined oral contraceptives, implants, transdermal patches, hormonal vaginal devices or injections with prolonged release), intrauterine device (IUD/IUS) or a double barrier method, e.g. condom and occlusive cap (diaphragm or cervical/vault caps) with spermicide (foam, gel, film, cream or suppository)"
- Pregnancy_considerations: "true abstinence (periodic abstinence and withdrawal are not acceptable methods of contraception)"
- Non-query-able: "sexual relationship only with female partners"
- Non-query-able: "sterile male partners"
- Informed_consent: "signed written informed consent and willingness to comply with treatment and follow-up procedures"
- Post-eligibility: "capability of understanding the investigational nature, potential risks and benefits of the clinical trial"